下列有關蕁麻疹及其病理機轉的配對，何者正確？
A. Physical urticaria-IgE-mediated
B. Blood product reaction-bradykinin-mediated
C. Food allergy-complement-mediated
D. Cholinergic urticaria-arachidonic acid-mediated

正確答案：A. Physical urticaria-IgE-mediated